Clinical trial exclusion criterion:
Use of any immunosuppressive drug at the time of the study or 30 days previously. Topical steroids will not be considered an immunosuppressive drug and their use will not be considered an exclusion criteria.

Annotated entities:
- Drug: "immunosuppressive drug"
- Temporal: "at the time of the study"
- Temporal: "30 days previously"
- Drug: "Topical steroids"
- Negation: "not"